Clinical trial exclusion criteria:
1. Patients with lumbar common diseases(e.g., Lumbar disc, Lumbar spinal stenosis, Lumbar slippage, etc)
2. Researchers think that Patients with disease may be interference results(e.g., Spinal deformity, spine fracture, ankylosing spondylitis, spinal tuberculosis and spinal infection, spinal tumor, pelvic inflammatory disease and other disease of department of gynaecology, etc)
3. Patients with other nervous system diseases(e.g., cerebral tumor, neurinoma, trigeminal neuralgia,etc)
4. Patients with Magnetic resonance imaging contraindication ,including claustrophobic syndrome patients
5. Patients with recent (less than 3 years) use chemical drugs or have obvious psychological problems
6. In the past 2 months involved in other drugs or devices clinical trials

Annotated entities:
- Condition: "lumbar diseases"
- Condition: "Lumbar disc"
- Condition: "Lumbar spinal stenosis"
- Condition: "Lumbar slippage"
- Condition: "Spinal deformity"
- Condition: "spine fracture,"
- Condition: "ankylosing spondylitis"
- Condition: "spinal tuberculosis"
- Condition: "spinal infection"
- Condition: "spinal tumor"
- Condition: "pelvic inflammatory disease"
- Condition: "nervous system diseases"
- Condition: "cerebral tumor"
- Condition: "neurinoma"
- Condition: "trigeminal neuralgia"
- Procedure: "Magnetic resonance imaging"
- Condition: "contraindication"
- Condition: "claustrophobic syndrome"
- Non-query-able: "atients with recent (less than 3 years) use chemical drugs or have obvious psychological problems"
- Competing_trial: "In the past 2 months involved in other drugs or devices clinical trials"